Clinical trial inclusion criterion:
Aged between 18-70 years

Entity relations:
- Has_value("Aged", "between 18-70 years")